Clinical trial exclusion criteria:
Intracranial infection.
Severe respiratory and circulatory system diseases.
Hematologic malignancies.
Positive serological tests such as AIDS, hepatitis B virus, hepatitis C virus and syphilis （antigen or antibody）.
Tumors.
Genetic and metabolic diseases.

Annotated entities:
- Condition: "Intracranial infection"
- Condition: "circulatory system disease"
- Condition: "respiratory system disease"
- Qualifier: "Severe"
- Condition: "Hematologic malignancies"
- Condition: "AIDS"
- Condition: "hepatitis B virus"
- Condition: "hepatitis C virus"
- Condition: "syphilis"
- Grammar_Error: "and"
- Condition: "Tumors"
- Condition: "metabolic diseases"
- Condition: "Genetic diseases"